Clinical trial inclusion criterion:
Infertile lean women with PCOS as defined by the Rotterdam criteria.

Annotated entities:
- Condition: "Infertile"
- Person: "women"
- Condition: "PCOS"
- Qualifier: "Rotterdam criteria"